Clinical trial exclusion criterion:
1. Presence of other neoplasia

Entity relations:
- Has_qualifier("neoplasia", "other")